Recent stroke or heart attack.

The above is a clinical trial exclusion criterion. Annotated with entity spans:
[Temporal: Recent] [Condition: stroke] or [Condition: heart attack].